En un pedrigrí de un rasgo autosómico dominante se observa que:
1. El rasgo aparece más frecuentemente en varones.
2. Las personas no afectadas no transmiten el rasgo.
3. El rasgo tiende a saltar generaciones.
4. Las personas afectadas tienen a ambos progenitores afectados.
5. El rasgo tiende a aparecer en la progenia de padres emparentados.

Respuesta correcta: 2. Las personas no afectadas no transmiten el rasgo.